癌症的分級（grading）與下列那一項有關？
A. 原發腫瘤的大小
B. 原發腫瘤的分化程度
C. 局部淋巴腺的侵犯程度
D. 轉移之有無

正確答案：B. 原發腫瘤的分化程度